Clinical trial inclusion criterion:
FEV1 < 40% of predicted value, FEV1/FVC < 70%

Entity relations:
- Has_value("FEV1", "< 40% of predicted value")
- Has_value("FEV1/FVC", "< 70%")